Arachnoid hemorrhage

The above is a clinical trial inclusion criterion. Annotated with entity spans:
[Condition: Arachnoid hemorrhage]